Clinical trial inclusion criterion:
Chronic intake of CNS active drugs

Entity relations:
- Has_multiplier("CNS active drugs", "Chronic intake")